Clinical trial exclusion criteria:
Inability to obtain consent from patient or patients kin
Pregnant women
less than 18 years of age of more than 80 years of age
Hunt Hess Grade 5 SAH

Annotated entities:
- Informed_consent: "Inability to obtain consent from patient or patients kin"
- Pregnancy_considerations: "Pregnant women"
- Person: "age"
- Value: "less than 18 years"
- Person: "age"
- Value: "more than 80 years"
- Measurement: "Hunt Hess Grade"
- Value: "5"
- Condition: "SAH"